一位 40 歲女性病人，5 年前因嚴重風濕性心臟病，二尖瓣膜狹窄及閉鎖不全接受二尖瓣膜置換手術。最近半年來，病患逐漸出現下肢水腫、腹部水腫而住院。住院身體檢查顯示頸靜脈嚴重鼓漲超過 cmH2O，明顯 V 波，左胸骨下緣有 Gr 3/6 全收縮期雜音（pansystolic murmur），無舒張期雜音，肝腫大並可摸到搏動。下列診斷何者最可能？
A. severe tricuspid regurgitation
B. severe mitral regurgitation
C. severe mitral stenosis
D. severe aortic stenosis

正確答案：A. severe tricuspid regurgitation